Leg ulcers of another underlying cause

The above is a clinical trial exclusion criterion. Annotated with entity spans:
[Condition: Leg ulcers] of [Qualifier: another] [Condition: underlying cause]